12歲男孩，身高185公分，四肢極為細長。經眼科檢查發現雙側Lens subluxation，下列何種檢查對診斷最無幫助？
A. Plasma amino acid level
B. Serum homocysteine level
C. Mutation analysis of Marfan Syndrome
D. Muscle biopsy

正確答案：D. Muscle biopsy